Clinical trial inclusion criterion:
durg-naive or drug-free

Entity relations:
- Has_negation("drug", "free")
- Has_negation("durg", "naive")
- OR("durg", "drug")